En fluorescencia atómica, la emisión de radiación electromagnética denominada florescencia resonante se produce cuando la longitud de onda de excitación es:
1. 100 nm superior a la longitud de onda de emisión.
2. 100 nm inferior a la longitud de onda de emisión.
3. Igual a la longitud de onda de emisión.
4. 100 nm superior a la longitud de onda de excitación.
5. 100 nm inferior a la longitud de onda de excitación.

Respuesta correcta: 3. Igual a la longitud de onda de emisión.